Clinical trial exclusion criterion:
9. Serum creatinine above ULN

Entity relations:
- Has_value("Serum creatinine", "above ULN")